Vestibular schwannoma advised to surgical treatment

The above is a clinical trial inclusion criterion. Annotated with entity spans:
[Condition: Vestibular schwannoma] [Mood: advised] to [Procedure: surgical treatment]